Clinical trial exclusion criterion:
Pregnancy or breast feeding

Entity relations:
- OR("Pregnancy", "breast feeding")